Clinical trial exclusion criterion:
Surgery and/or previous ocular pathology (presence of scar/change in the cornea, glaucoma, retinopathies, etc.).

Entity relations:
- Has_temporal("ocular pathology", "previous")
- Subsumes("ocular pathology", "scar")
- OR("Surgery", "ocular pathology")
- OR("scar", "change in the cornea", "glaucoma", "retinopathies")